Clinical trial exclusion criterion:
DKA(Diabetic Ketoacidosis) or HHS(Hyperosmoloar Hyperglycaemic Syndrome) within the last 6 months

Annotated entities:
- Condition: "DKA"
- Condition: "Diabetic Ketoacidosis"
- Condition: "HHS"
- Condition: "Hyperosmoloar Hyperglycaemic Syndrome"
- Temporal: "within the last 6 months"